下列何者對於急性全身輻射暴露的耐受性最高？
A. 甲狀腺
B. 造血系統
C. 中樞神經
D. 胃腸道

正確答案：C. 中樞神經